informed consent and (if applicable) assent

The above is a clinical trial inclusion criterion. Annotated with entity spans:
[Informed_consent: informed consent and (if applicable) assent]